Clinical trial inclusion criteria:
patients with =20° passive extension deficit (PED) in metacarpophalangeal (MP) or proximal interphalangeal (PIP) joint, or TPED of =30° in MP and PIP joints of finger/fingers II-V
age > 18 years
palpable cord
provision of informed consent
ability to fill the Finnish versions of questionnaires.

Annotated entities:
- Condition: "passive extension deficit (PED)"
- Qualifier: "=20°"
- Qualifier: "joint metacarpophalangeal (MP)"
- Qualifier: "proximal interphalangeal (PIP) joint"
- Condition: "TPED"
- Qualifier: "=30°"
- Qualifier: "MP"
- Qualifier: "PIP joints"
- Qualifier: "finger/fingers II-V"
- Person: "age"
- Value: "> 18 years"
- Condition: "palpable cord"
- Informed_consent: "provision of informed consent"
- Non-query-able: "ability to fill the Finnish versions of questionnaires."